下列何者發生阻塞時，最不會影響陰道的血液供應？
A. 卵巢動脈
B. 子宮動脈
C. 直腸中動脈
D. 陰部內動脈

正確答案：A. 卵巢動脈